List features of the Perry syndrome.

Perry syndrome is a familial parkinsonism associated with central hypoventilation, mental depression, and weight loss.